History of angioedema to treatment with ACE inhibitors or ARBs

The above is a clinical trial exclusion criterion. Annotated with entity spans:
[Temporal: History of] [Condition: angioedema] to [Procedure: treatment] with [Drug: ACE inhibitors] or [Drug: ARBs]